一位30歲女性，過去健康狀況良好，並無重大疾病。她在3個月前剖腹產下一個健康男嬰。懷孕及生產過程也 很順利。但生產後，她卻發現即使沒有碰撞，也常有皮膚大片瘀青，有時甚至會有皮下血腫。病人否認有任何藥物的服用或是毒物的曝露。血液數據顯示，白血球9,600/μL，血紅素10.7 g/dL，血小板210,000/μL，白血球分類無異常。PT 10.3 sec（INR 0.95），aPTT 98 sec，以normal plasma做mixing test無法完全矯正延長的
 aPTT。factor VIIIc的活性小於1%，而factor VIII antibody是28.41 BU/mL（參考值＜0.6）。以下關於這位病人最可能的疾病之診斷與治療，何者錯誤？
A. 此類病人常常有hemarthrosis
B. 除了懷孕生產之外，此病亦可能與惡性腫瘤與自體免疫疾病有關連性，但是約有一半的病人找不到明顯的原因
C. 嚴重出血危及生命時，可以輸注PCC（prothrombin complex concentrate）或是recombinant factor VIIa來止血
D. 治療有反應者，在停藥之後，還是可能有高達約20%的病人在半年內復發

正確答案：A. 此類病人常常有hemarthrosis